Clinical trial exclusion criterion:
BMI <35 and > 60 kg/m2

Annotated entities:
- Measurement: "BMI"
- Value: "<35 and > 60 kg/m2"